Acquired acute ankle injury (injured less than 48 hours ago);

The above is a clinical trial inclusion criterion. Annotated with entity spans:
[Qualifier: Acquired] [Condition: acute ankle injury] (injured [Temporal: less than 48 hours ago]);